Clinical trial exclusion criterion:
clinical suspicion that subject can not use PCA adequately

Entity relations:
- Has_mood("subject can not use PCA adequately", "clinical suspicion")